下列那一心臟疾病不屬於感染性心內膜炎的中度或高度危險群？
A. 機械瓣膜置換手術後病患
B. 存開性動脈導管（patent ductus arteriosus）
C. 二尖瓣（僧帽瓣）脫垂合併二尖瓣閉鎖不全
D. 心房中隔缺損（secundum type atrial septal defect）

正確答案：D. 心房中隔缺損（secundum type atrial septal defect）